Según se recoge en el proyecto de Ley sobre Dependencia de 2006, en España, es cierto que:
1. La dependencia se entiende como un estado de carácter permanente.
2. La dependencia siempre está ligada a la discapacidad física.
3. La dependencia se clasifica en tres grados: leve, mediana y severa.
4. En todos los grados de dependencia contemplados en la ley se requiere la presencia permanente de un cuidador.
5. Se define “la necesidad de ayuda” como el apoyo indispensable y continuo de otra persona a lo largo del día.

Respuesta correcta: 1. La dependencia se entiende como un estado de carácter permanente.